Newly diagnosed or without steroid use during last 1 year

The above is a clinical trial inclusion criterion. Annotated with entity spans:
Newly diagnosed or [Negation: without] [Drug: steroid] use [Temporal: during last 1 year]